En la práctica clínica se utiliza cada vez con más frecuencia el diagnóstico informal de “Depresión doble”, ¿a qué se refiere este concepto?
1. Pacientes que presentan conjuntamente un episodio depresivo y un trastorno distímico.
2. Pacientes que presentan conjuntamente un episodio mixto y un trastorno ciclotímico.
3. Pacientes que presentan conjuntamente un trastorno bipolar y un trastorno depresivo mayor.
4. Pacientes que presentan conjuntamente un trastorno depresivo mayor y un trastorno distímico.
5. Pacientes que presentan conjuntamente un trastorno ciclotímico y un trastorno depresivo mayor.

Respuesta correcta: 4. Pacientes que presentan conjuntamente un trastorno depresivo mayor y un trastorno distímico.